sickle cell disease

The above is a clinical trial exclusion criterion. Annotated with entity spans:
[Condition: sickle cell disease]